一位 25 歲女性，因為嚴重腹瀉入急診就醫。症狀自 2 天前就開始，水狀腹瀉（watery diarrhea），1 天約 8 次左右，伴隨有間歇性腹痛以及發燒發冷（fever and chills）的症狀。理學檢查發現腸音加快，無明顯壓痛（tenderness）與反彈痛（rebounding pain）。糞便檢查高倍鏡下發現有 10-20 顆白血球。若你懷疑此病人有感染性腹瀉需使用抗生素時，下列何者為最佳的選擇？
A. Trimethoprim/sulfamethexazole
B. Cephalexin
C. Augmentin（amoxicillin with clavulanic acid）
D. Ciprofloxacin

正確答案：D. Ciprofloxacin